Clinical trial exclusion criterion:
malignancy (except basal cell carcinoma) and/or chemotherapy within 1 year prior to screening; malignancy more than 1 year prior to screening must have been local and without metastasis and/or recurrence, and if treated with chemotherapy, without nervous system complications;

Entity relations:
- Has_negation("basal cell carcinoma", "except")
- Has_index("within 1 year prior to screening", "screening")
- Has_temporal("chemotherapy", "within 1 year prior to screening")
- Has_negation("metastasis", "without")
- Has_qualifier("malignancy", "local")
- Has_temporal("malignancy", "more than 1 year")
- AND("malignancy", "metastasis")
- OR("malignancy", "chemotherapy", "malignancy")
- OR("metastasis", "recurrence")